產程中胎頭下降的停頓，易發生於下列那一項情況？
A. 毒血症
B. 糖尿病
C. 羊水過多
D. 骨盆及胎頭不對稱

正確答案：D. 骨盆及胎頭不對稱